Sitting systolic BP < 100 mmHg

The above is a clinical trial exclusion criterion. Annotated with entity spans:
[Qualifier: Sitting] [Condition: systolic BP] [Value: < 100 mmHg]